Atopic dermatitis subjects who are coincident with Hanifin and Rajka diagnosis criteria

The above is a clinical trial inclusion criterion. Annotated with entity spans:
[Condition: Atopic dermatitis] subjects who are coincident with [Measurement: Hanifin and Rajka diagnosis criteria]